Clinical trial exclusion criterion:
pregnant or breastfeeding women

Entity relations:
- OR("pregnant", "breastfeeding")